Contraindication for hepatectomy, including gastrointestinal hemorrhage, severe hemorrhagic disorders, explicit acute nonspecific infectious lesion, overt ascites, Child-Pugh Score C, indocyanine green retention rate at 15min (ICGR15)＞30%(12), serum hepatitis B virus (HBV)-DNA＞126 copies/ml and serum alanine aminotransferase (ALT) ＞ 2×ULN, serum triglycerides＞2.0 mmol/L, circulatory shock, stroke, acute myocardial infarction, renal failure, coma of unknown cause

The above is a clinical trial exclusion criterion. Annotated with entity spans:
[Condition: Contraindication for hepatectomy], including [Condition: gastrointestinal hemorrhage], [Qualifier: severe] [Condition: hemorrhagic disorders], explicit [Temporal: acute] [Qualifier: nonspecific] [Condition: infectious lesion], [Qualifier: overt] [Condition: ascites], [Measurement: Child-Pugh Score] [Value: C], [Measurement: indocyanine green retention rate at 15min (ICGR15)][Value: ＞30%](12), [Measurement: serum hepatitis B virus (HBV)-DNA][Value: ＞126 copies/ml] and [Measurement: serum alanine aminotransferase (ALT)] [Value: ＞ 2×ULN], [Measurement: serum triglycerides][Value: ＞2.0 mmol/L], [Condition: circulatory shock], [Condition: stroke], [Condition: acute myocardial infarction], [Condition: renal failure], [Condition: coma] of [Qualifier: unknown cause]